La mutación que cambia la secuencia de aminoácidos de la proteínas sin alterar su función se denomina:
1. Neutral.
2. Silenciosa.
3. Supresora intragénica.
4. Supresora intergénica.

Respuesta correcta: 1. Neutral.